A cardiovascular event in the past month

The above is a clinical trial exclusion criterion. Annotated with entity spans:
A [Condition: cardiovascular event] [Temporal: in the past month]